Clinical trial inclusion criterion:
Over 18 years old.

Entity relations:
- Has_value("old", "Over 18 years old")